乳腺內側的淋巴主要匯入：
A. 肩胛下淋巴結（Subscapular lymph nodes）
B. 前胸淋巴結（Anterior pectoral nodes）
C. 鎖骨下淋巴結（Subclavicular nodes）
D. 旁胸淋巴結（Para sternal nodes）

正確答案：D. 旁胸淋巴結（Para sternal nodes）